En general, los enzimas alostéricos:
1. Unen los efectores en el centro activo.
2. Forman enlaces covalentes con sus efectores negativos.
3. Originan curvas hiperbólicas de velocidad ante la concentración de sustrato.
4. Cambian de conformación cuando unen efectores.
5. Se modifican irreversiblemente cuando son inhibidos.

Respuesta correcta: 4. Cambian de conformación cuando unen efectores.